Clinical trial inclusion criterion:
Known or suspected gram-positive infection.

Entity relations:
- Has_qualifier("infection", "gram-positive")